Clinical trial inclusion criterion:
generally healthy grade 1-2 school children

Annotated entities:
- Condition: "generally healthy"
- Observation: "grade 1-2 school"
- Person: "children"